一位子宮頸癌病人做了 intravenous pyelogram（IVP）後，發現左側腎臟完全不顯影，則此病人至少為 FIGO staging 的第幾期？
A. Ib
B. Ⅱb
C. Ⅲb
D. IVb

正確答案：C. Ⅲb